Clinical trial exclusion criterion:
Patients with trauma within 6 months pre-operative.

Entity relations:
- multi("pre-operative", "operative")
- Has_index("within 6 months pre-operative", "pre-operative")
- Has_temporal("trauma", "within 6 months pre-operative")